Clinical trial exclusion criterion:
use more than 2g a day; 5 times a week to everyday

Entity relations:
- Has_multiplier("more than 2g a day", "5 times a week to everyday")